Clinical trial exclusion criterion:
Contraindication for thoracic paravertebral block

Annotated entities:
- Condition: "Contraindication"
- Qualifier: "thoracic"
- Procedure: "paravertebral block"